孕婦在妊娠第一期腹痛至門診，經檢查後發現子宮頸已經開了3公分，此時最可能的診斷是：
A. 不完全流產（incomplete abortion）
B. 無法避免的流產（inevitable abortion）
C. 過期流產（missed abortion）
D. 敗血性流產（septic abortion）

正確答案：B. 無法避免的流產（inevitable abortion）